下列何項免疫因子與習慣性流產較無關聯？
A. lupus anticoagulant
B. anticardiolipin antibody
C. antinuclear antibody
D. antiovarian antibody

正確答案：D. antiovarian antibody